Clinical trial inclusion criterion:
Pts have current treatment plan at OHSU for extraction of some or all of remaining teeth and scheduled for delivery of a removable appliance post extraction

Annotated entities:
- Mood: "treatment plan at OHSU"
- Mood: "scheduled for"
- Non-representable: "Pts have current treatment plan at OHSU for extraction of some or all of remaining teeth and scheduled for delivery of a removable appliance post extraction"